下列有關脾臟的敘述，何者正確？
A. 圍動脈淋巴鞘（Periarterial lymphatic sheath, PALS）主要由 B 淋巴球構成
B. 淋巴小結（lymphatic nodules）主要由 T 淋巴球構成
C. PALS 與淋巴小結構成紅髓（red pulp）
D. 在白髓（white pulp）中淋巴組織圍繞的血管是中央動脈（central artery）

正確答案：D. 在白髓（white pulp）中淋巴組織圍繞的血管是中央動脈（central artery）